Cared for in the pediatric intensive care unit or pediatric cardiac intensive care unit

The above is a clinical trial inclusion criterion. Annotated with entity spans:
Cared for in the [Visit: pediatric intensive care unit] or [Visit: pediatric cardiac intensive care unit]